Clinical trial inclusion criterion:
Patients able to provide consent to study participation

Annotated entities:
- Post-eligibility: "Patients able to provide consent to study participation"